Clinical trial inclusion criterion:
The patients have no history of neoadjuvant hormone therapy.

Annotated entities:
- Procedure: "neoadjuvant hormone therapy"
- Negation: "no history"